下列那些寄生蟲會造成患者之自體感染（autoinfection）？①短小包膜絛蟲（Hymenolepis nana） ②菲律 賓毛線蟲（Capillaria philippinensis） ③隱胞子蟲（Cryptosporidium parvum） ④糞小桿線蟲
 （Strongyloides stercoralis）
A. 1種
B. 2種
C. 3種
D. 4種

正確答案：D. 4種